What is the KDEL retention signal?

the -KDEL retention signal sequence is characteristic of many proteins localized to the ER.